Clinical trial exclusion criterion:
Cholecystectomy

Annotated entities:
- Procedure: "Cholecystectomy"